依全民健康保險法第48條之規定，保險對象有下列情形之一者，免依全民健康保險法規定自行負擔費用，下列何者不在此範圍內？
A. 重大傷病
B. 分娩
C. 中低收入戶
D. 山地離島地區之就醫

正確答案：C. 中低收入戶